Clinical trial exclusion criterion:
Diagnosis of chronic pain currently taking opioid pain medication or with a history of drug abuse.

Annotated entities:
- Condition: "chronic pain"
- Drug: "opioid pain medication"
- Temporal: "history of"
- Condition: "drug abuse"